Clinical trial exclusion criterion:
Suspected current drug or alcohol abuse

Entity relations:
- Has_context("drug abuse", "Suspected")
- Has_temporal("drug abuse", "current")
- OR("drug abuse", "alcohol abuse")